Clinical trial exclusion criterion:
Patients with cardiac, pulmonary, hepatic, or renal dysfunction, epilepsy, or uncontrolled hypertension, or those taking medications that influence the central nervous system, are excluded from the study. Patients who show obvious alteration of mental status, or refuse to participate, are also excluded from the study.

Entity relations:
- Has_qualifier("hypertension", "uncontrolled")
- multi("refuse to participate", "refuse to participate")
- OR("cardiac dysfunction", "refuse to participate", "renal dysfunction", "pulmonary dysfunction", "hepatic dysfunction", "epilepsy", "hypertension", "medications that influence the central nervous system", "alteration of mental status")